一位健康者於平靜呼氣過程中，不會發生下列何種情況？
A. 肺泡壓（alveolar pressure）為正壓
B. 肋膜內壓（intrapleural pressure）為負壓
C. 外肋間肌（external intercostal muscles）收縮
D. 約與吸氣的氣體總量相同

正確答案：C. 外肋間肌（external intercostal muscles）收縮